Clinical trial inclusion criteria:
Healthy children aged 6 months to 72 months

Annotated entities:
- Condition: "Healthy"
- Person: "children"
- Person: "aged"
- Value: "6 months to 72 months"